Clinical trial exclusion criterion:
17. Concomitant administration of any drug that could affect bleeding (e.g., aspirin, clopidogrel, ticlopidine, warfarin, heparin, low-molecular weight heparin)

Entity relations:
- Subsumes("drug that could affect bleeding", "aspirin")
- OR("aspirin", "heparin", "warfarin", "ticlopidine", "clopidogrel", "low-molecular weight heparin")